一位 45 歲女性出現外陰部搔癢的症狀，內診發現大陰唇有一紅色、界線分明像地圖樣分布的病灶，黏膜下可以摸到一顆腫瘤，切片檢查發現在表皮上出現一些大的腫瘤細胞，具有細緻的顆粒狀細胞質，以 Alcian blue 染色呈陽性結果，而這些腫瘤細胞和周邊正常表皮細胞間有一清楚的亮暈。則下列何者為最可能之診斷？
A. 女陰上皮內贅生（vulvar intraepithelial neoplasm）
B. 乳房外潘吉德氏病（extramammary Paget disease）
C. 惡性黑色素瘤（malignant melanoma）
D. 硬化性苔癬（lichen sclerosus）

正確答案：B. 乳房外潘吉德氏病（extramammary Paget disease）